Clinical trial exclusion criterion:
The subject has had another active malignancy within the past 5 years except for cervical cancer in situ, in situ carcinoma of the bladder or non-melanoma carcinoma of the skin.

Entity relations:
- Has_temporal("active malignancy", "within the past 5 years")
- Has_negation("cervical cancer in situ", "except")
- AND("active malignancy", "cervical cancer in situ")
- OR("cervical cancer in situ", "non-melanoma carcinoma of the skin", "in situ carcinoma of the bladder")